History of psychiatric disorders or cognitive impairment

The above is a clinical trial exclusion criterion. Annotated with entity spans:
History of [Condition: psychiatric disorders] or [Condition: cognitive impairment]